Have been treated with exogenous insulin for more than 1 week within the 3 months prior to screening.

The above is a clinical trial exclusion criterion. Annotated with entity spans:
Have been treated with [Drug: exogenous insulin] [Multiplier: for more than 1 week] [Temporal: within the 3 months prior to screening].